Which disease is treated with Eliglustat?

Eliglustat was developed for treatment of Gaucher's disease type 1.